Known allergy/sensitivity or any hypersensitivity to components of study drugs or their formulation.

The above is a clinical trial exclusion criterion. Annotated with entity spans:
Known [Condition: allergy]/[Condition: sensitivity] or any [Condition: hypersensitivity] to [Drug: components of study drugs] or their formulation.